have no serologic evidence of active HBV infection evidenced by negative hepatitis B surface antigen

The above is a clinical trial inclusion criterion. Annotated with entity spans:
have no [Condition: serologic evidence of active HBV infection] evidenced by [Value: negative] [Measurement: hepatitis B surface antigen]